Clinical trial exclusion criterion:
Evidence of possible liver damage defined by an aspartate transaminase (AST) level that is more than 3x the upper limit of normal in an asymptomatic patient

Annotated entities:
- Condition: "liver damage"
- Measurement: "aspartate transaminase"
- Measurement: "AST"
- Value: "more than 3x the upper limit of normal"